Subjects with a history of drug or alcohol abuse within the past 6 months

The above is a clinical trial exclusion criterion. Annotated with entity spans:
Subjects with a [Temporal: history of] [Condition: drug] or [Condition: alcohol abuse] [Temporal: within the past 6 months]